Obesity (Body Mass Index > 30)

The above is a clinical trial exclusion criterion. Annotated with entity spans:
[Condition: Obesity] ([Measurement: Body Mass Index] [Value: > 30])